Willing to undergo second eye surgery within 7 days after first eye surgery;

The above is a clinical trial inclusion criterion. Annotated with entity spans:
[Non-query-able: Willing to undergo second eye surgery within 7 days after first eye surgery;]